下列何者是兒童泌尿道感染最常合併的先天構造泌尿道異常？
A. 腎臟輸尿管交接處狹窄（UPJ stenosis）
B. 膀胱輸尿管交接處狹窄（VUJ stenosis）
C. 膀胱輸尿管逆流（vesicoureteral reflux）
D. 神經性膀胱（neurogenic bladder）

正確答案：C. 膀胱輸尿管逆流（vesicoureteral reflux）